Clinical trial inclusion criterion:
Males and females aged 18-40 years of age at the time of vaccination in good health as determined by medical history, physical exam, laboratory assessments and the clinical judgment of the Principal Investigator

Entity relations:
- Has_value("age", "18-40 years")
- Has_value("aged", "18-40 years")
- Has_index("at the time of vaccination", "time of vaccination")
- Has_temporal("18-40 years", "at the time of vaccination")
- Subsumes("good health", "medical history")
- Subsumes("good health", "physical exam")
- Subsumes("good health", "laboratory assessments")